Clinical trial exclusion criterion:
Total bilirubin > 2 x ULN

Annotated entities:
- Measurement: "Total bilirubin"
- Value: "> 2 x ULN"